(2)Exhibited good tolerance to enalapril and good overall medication compliance (>80%) in run-in period or previously exhibited good tolerance and adherence to ACEI drugs in previous medication history.

The above is a clinical trial inclusion criterion. Annotated with entity spans:
(2)Exhibited [Condition: good tolerance to enalapril] and [Value: good] [Measurement: overall medication compliance] ([Value: >80%]) in run-in period or [Temporal: previously] exhibited [Condition: good tolerance] and adherence to [Drug: ACEI drugs] in previous [Temporal: medication history].